Contraindication to peripheral nerve blockade or general anesthesia including:

The above is a clinical trial exclusion criterion. Annotated with entity spans:
[Condition: Contraindication to peripheral nerve blockade] or general anesthesia including: